¿En qué modelo se basan los programas de intervención empleados con más éxito en el tratamiento temprano del autismo infantil?
1. En el análisis aplicado de la conducta.
2. En el conductismo neomediacional.
3. En la teoría del aprendizaje social.
4. En el psicoanálisis lacaniano.
5. En la teoría del apego.

Respuesta correcta: 1. En el análisis aplicado de la conducta.